下列那一項是懷疑肌肉性疾病最不重要的檢查？
A. 甲狀腺荷爾蒙
B. 肌肉酵素如：CPK、GOT、LDH
C. 肌電圖
D. 核醫掃描

正確答案：D. 核醫掃描